Anticoagulant therapy (e.g. Warfarin, Plavix, etc.), will not be automatic exclusion but patients will be required to have INR test performed and have values between 2.0 to 3. Physician consultation will be requested to determine whether anticoagulant therapy can be discontinued for 3 days prior to surgery.

The above is a clinical trial exclusion criterion. Annotated with entity spans:
[Procedure: Anticoagulant therapy] (e.g. [Drug: Warfarin], [Drug: Plavix], etc.), [Grammar_Error: will not be automatic exclusion] but patients will be required to have [Measurement: INR test] performed and have values [Value: between 2.0 to 3]. [Not_a_criteria: Physician consultation will be requested to determine whether anticoagulant therapy can be discontinued for 3 days prior to surgery.]